La isotacoforesis capilar (CITP), separa:
1. Cationes pero no puede separar aniones.
2. Aniones pero no puede separar cationes.
3. Cationes y aniones de forma simultánea.
4. Catones y aniones pero no de forma simultánea.
5. Solo moléculas neutras.

Respuesta correcta: 4. Catones y aniones pero no de forma simultánea.